Clinical trial exclusion criterion:
Donation blood or serum within 8 weeks before the first dose administration to a blood bank or blood donation center.

Entity relations:
- Has_index("within 8 weeks before", "first dose administration")
- Has_temporal("Donation serum", "within 8 weeks before")
- Has_temporal("Donation blood", "within 8 weeks before")
- OR("Donation blood", "Donation serum")